Clinical trial exclusion criterion:
Congenital or acquired coagulopathy as evidence by INR >1.4 or PTT > 1.4 times normal, or Platelets <150,000/mm3 on preoperative laboratory testing

Annotated entities:
- Qualifier: "Congenital"
- Qualifier: "acquired"
- Condition: "coagulopathy"
- Measurement: "INR"
- Value: ">1.4 times normal"
- Measurement: "PTT"
- Value: "> 1.4 times normal"
- Measurement: "Platelets"
- Value: "<150,000/mm3"
- Procedure: "preoperative laboratory testing"